Clinical trial inclusion criterion:
7. No Serious Cardiac,Pulmonary,Hepatic and Nephritic disease

Entity relations:
- Has_negation("Cardiac,Pulmonary,Hepatic", "No")
- OR("Cardiac", "Nephritic disease", "Pulmonary", "Hepatic")